Clinical trial inclusion criterion:
Written consent for participation in the clinical trial

Annotated entities:
- Informed_consent: "Written consent for participation in the clinical trial"